Clinical trial inclusion criterion:
5. Multivessel disease with at least one significant stenosis in LAD and with treatment of the lesion in another major epicardial coronary artery. A two-vessel disease or a three-vessel disease may be viewed as a combination of a side branch and a main epicardial vessel provided they supply different territories; left anterior descending, left circumflex and right coronary artery);

Annotated entities:
- Condition: "Multivessel disease"
- Value: "at least one"
- Condition: "significant stenosis in LAD"
- Procedure: "treatment of the lesion"
- Qualifier: "in another major epicardial coronary artery"
- Non-representable: "A two-vessel disease or a three-vessel disease may be viewed as a combination of a side branch and a main epicardial vessel provided they supply different territories; left anterior descending, left circumflex and right coronary artery);"